All residents residing near to the well sites that are randomly selected for this study.

The above is a clinical trial exclusion criterion. Annotated with entity spans:
All residents [Observation: residing] [Visit: near to the well sites] that are randomly selected for this study.